Acute pain (less than 3 months in duration)

The above is a clinical trial exclusion criterion. Annotated with entity spans:
[Qualifier: Acute] [Condition: pain] ([Value: less than 3 months] in [Measurement: duration])